Clinical trial inclusion criterion:
Life expectancy should be greater than 6 months.

Entity relations:
- Has_value("Life expectancy", "greater than 6 months")